QT間距延長症候群（long QT syndrome）是一種先天性心臟離子通道病變 （channelopathy）。下列何種藥物有可能加重其QT延長之變化，應避免？①clarithromycin 
 ②amiodarone ③acetaminophen ④haloperidol
A. ①②③
B. ②③④
C. ①③④
D. ①②④

正確答案：D. ①②④